下列何者符合健康保險之國際趨勢？
A. 局限於避免因病而貧
B. 朝向商業化與資本化
C. 減輕對費用上漲的控制
D. 重視基層保健與健康促進

正確答案：D. 重視基層保健與健康促進